Clinical trial inclusion criterion:
Lucid and without diagnosis of any psychiatric disorder;

Annotated entities:
- Condition: "psychiatric disorder"
- Negation: "without"
- Condition: "Lucid"